En un programa cuyo objetivo es capacitar a los adolescentes para que puedan elegir conductas orientadas a la salud y ayudar a los padres a promover la adaptación saludable de sus hijos, la población diana estará formada por:
1. Padres de adolescentes de ambos sexos residentes en la zona básica de salud.
2. Adolescentes de ambos sexos y sus padres residentes en la zona básica de salud.
3. Padres, profesores y cuidadores de adolescentes residentes en la zona básica de salud.
4. Los amigos y las amigas de adolescentes de la zona básica de salud.
5. Adolescentes de ambos sexos que residan en la zona básica de salud.

Respuesta correcta: 2. Adolescentes de ambos sexos y sus padres residentes en la zona básica de salud.